How are super enhancers defined?

Super-enhancers comprise of clusters of enhancers that are typically defined by the ChIP-seq analysis for active histone marks. called super-enhancers, that recruit much of the cell's transcriptional apparatus and are defined by extensive acetylation of histone H3 lysine 27 (H3K27ac). Super-enhancers (SEs) are large clusters of transcriptional enhancers that drive expression of genes controlling cell identity. Super-enhancers are large clusters of transcriptional enhancers regarded as having essential roles in driving the expression of genes that control cell identity during development and tumorigenesis.